Clinical trial inclusion criterion:
stable metabolic status

Entity relations:
- Has_qualifier("metabolic status", "stable")